Which is the physiological target for LeuRS translational quality control?

The physiological target for LeuRS translational quality control is norvaline.